Clinical trial inclusion criterion:
HIV-1 antibody negative

Annotated entities:
- Measurement: "HIV-1 antibody"
- Value: "negative"